Clinical trial exclusion criterion:
Gestational age less than 37 completed weeks

Entity relations:
- Has_value("Gestational age", "less than 37 completed weeks")